Diagnosis of asthma

The above is a clinical trial exclusion criterion. Annotated with entity spans:
Diagnosis of [Condition: asthma]